Endoscopic and histological confirmed diagnosis of intestinal metaplasia,

The above is a clinical trial inclusion criterion. Annotated with entity spans:
[Qualifier: Endoscopic] and [Qualifier: histological confirmed] diagnosis of [Condition: intestinal metaplasia],